Clinical trial exclusion criterion:
Any medical reason why, in the opinion of the investigator, the patient should not participate

Annotated entities:
- Post-eligibility: "Any medical reason why, in the opinion of the investigator, the patient should not participate"